Clinical trial inclusion criterion:
HIV-1 plasma RNA less than 50 copies/mL obtained within 90 days prior to study entry by any FDA-approved assay at any United States laboratory that has a Clinical Laboratory Improvement Amendments (CLIA) certification or its equivalent, or at any network-approved non-US laboratory that operates in accordance with Good Clinical Laboratory Practices (GCLP) and participates in appropriate external quality assurance programs.

Entity relations:
- Has_value("HIV-1 plasma RNA", "less than 50 copies/mL")
- Has_temporal("HIV-1 plasma RNA", "within 90 days prior to study entry")
- Has_index("within 90 days prior to study entry", "study entry")